Name a CFL2 mutation which is associated with nemaline myopathy?

A mutation in CFL2 was identified in a family with nemaline myopathy, namely a homozygous missense mutation in exon 2 (c.19G>A, p.Val7Met).